History of alcohol or drug abuse or dependence within 1 month prior to study entry

The above is a clinical trial exclusion criterion. Annotated with entity spans:
[Temporal: History] of alcohol or [Condition: drug abuse] or [Condition: dependence] [Temporal: within 1 month prior] to study entry